>18 to < 90 years old

The above is a clinical trial inclusion criterion. Annotated with entity spans:
[Value: >18 to < 90 years] [Person: old]